COPD: dyspnea: progressive (worsens over time), increases with exertion, persistent; chronic cough (may appear sporadically and may be unproductive); chronic expectoration; the impact of risk factors in the medical history (Smoking, occupational dust pollutants and chemicals); widespread wheeze on auscultation of the chest and/or distant wheezing in the chest; family history of COPD; spirometric data confirming the presence of fixed bronchial obstruction.

The above is a clinical trial inclusion criterion. Annotated with entity spans:
[Condition: COPD]: [Condition: dyspnea]: [Qualifier: progressive] ([Qualifier: worsens over time]), [Qualifier: increases with exertion], [Qualifier: persistent]; [Condition: chronic cough] (may appear sporadically and may be unproductive); [Condition: chronic expectoration]; the impact of [Condition: risk factors] in the medical history ([Condition: Smoking], [Condition: occupational dust pollutants and chemicals]); [Qualifier: widespread] [Condition: wheeze on auscultation of the chest] and/or [Condition: distant wheezing in the chest]; [Observation: family history] of [Condition: COPD]; [Procedure: spirometric] data confirming the presence of [Condition: fixed bronchial obstruction].